Clinical trial exclusion criterion:
Columbia-Suicide Severity Rating Scale (C-SSRS) for suicidal ideation and behavior in past year.

Annotated entities:
- Measurement: "Columbia-Suicide Severity Rating Scale"
- Measurement: "C-SSRS"
- Condition: "suicidal ideation"
- Condition: "suicidal behavior"
- Temporal: "in past year"